What is the basis of the BLISS technique?

BLISS is a versatile and quantitative method for genome-wide profiling of DNA double-strand breaks.